Clinical trial inclusion criterion:
Adult patients with T2DM who are indicated to receive liraglutide, not as first-line therapy, in addition to diet and exercise to improve glycemic control

Entity relations:
- Has_negation("first-line therapy", "not")
- Has_qualifier("liraglutide", "first-line therapy")
- Has_mood("liraglutide", "indicated to receive")